En cuanto a los estertores agónicos (estertores pre mortem) es cierto que:
1. Es una situación bien tolerada por la familia.
2. Originan una respiración silenciosa.
3. Se tratan con morfina.
4. Se tratan con procinéticos.
5. Se tratan con escopolamina.

Respuesta correcta: 5. Se tratan con escopolamina.